History of intracranial haemorrhage

The above is a clinical trial exclusion criterion. Annotated with entity spans:
[Temporal: History] of [Condition: intracranial haemorrhage]